Clinical trial inclusion criterion:
Patient is receiving or scheduled to receive chemotherapy within 30 days before or after the procedure

Entity relations:
- Has_mood("chemotherapy", "is receiving")
- Has_index("within 30 days before or after the procedure", "the procedure")
- Has_temporal("is receiving", "within 30 days before or after the procedure")
- OR("is receiving", "scheduled to receive")